Clinical trial exclusion criterion:
Hemoglobin (Hb) < 8 g/dL

Entity relations:
- Subsumes("Hemoglobin", "Hb")
- Has_value("Hemoglobin", "< 8 g/dL")